Patients with PN during their hospitalization

The above is a clinical trial inclusion criterion. Annotated with entity spans:
Patients with [Procedure: PN] [Temporal: during their hospitalization]